下列何者非新生兒低血糖之危險因子？
A. 母親有糖尿病
B. 貧血
C. 早產兒
D. 敗血症

正確答案：B. 貧血